La reacción de Chichibabin es un ejemplo de sustitución nucleofila en un anillo de:
1. Benceno.
2. Antraceno.
3. Bifenilo.
4. Piridina.
5. Pirrol.

Respuesta correcta: 4. Piridina.